Clinical trial exclusion criterion:
Is a recipient of a prophylactic or therapeutic HIV vaccine candidate at any time, or a recipient of other experimental vaccine(s) within the last 12 months. For participants who received an experimental vaccine (except HIV vaccine) more than 12 months ago, documentation of the identity of the experimental vaccine must be provided to the sponsor, who will determine eligibility on a case-by-case basis

Annotated entities:
- Drug: "HIV vaccine candidate"
- Temporal: "at any time"
- Drug: "other experimental vaccine(s)"
- Context_Error: "other experimental vaccine(s)"
- Temporal: "within the last 12 months"
- Qualifier: "therapeutic"
- Qualifier: "prophylactic"
- Drug: "experimental vaccine"
- Drug: "HIV vaccine"
- Negation: "except"
- Temporal: "more than 12 months ago"
- Context_Error: "experimental vaccine"
- Undefined_semantics: "experimental vaccine"
- Subjective_judgement: "case-by-case basis"